Clinical trial exclusion criterion:
Evidence or suspect of Progressive Multifocal Leukoencephalopathy (PML) in Magnetic Resonance Imaging (MRI).

Entity relations:
- AND("Magnetic Resonance Imaging (MRI)", "Progressive Multifocal Leukoencephalopathy (PML)")
- Has_mood("Progressive Multifocal Leukoencephalopathy (PML)", "Evidence")
- OR("Evidence", "suspect")